2. Are pregnant or lactating

The above is a clinical trial exclusion criterion. Annotated with entity spans:
2. Are [Condition: pregnant] or [Condition: lactating]